Allergy to ropivacaine, bupivacaine, or other local anesthetic agents

The above is a clinical trial exclusion criterion. Annotated with entity spans:
[Condition: Allergy] to [Drug: ropivacaine], [Drug: bupivacaine], or other [Drug: local anesthetic agents]